Clinical trial inclusion criterion:
Bilirubin < ULN.

Annotated entities:
- Measurement: "Bilirubin"
- Value: "< ULN"